What is the role of thyroid hormone receptor alpha1 in insulin secretion?

Liganded TR(alpha) plays a critical role in beta-cell replication and in expansion of the beta-cell mass. the TRalpha P398H mutation which cannot bind T3, is associated with  insulin resistance. Loss of Thra protects mice from high-fat diet-induced hepatic and peripheral insulin resistance.